Women with previous SLNBx or axillary node dissection

The above is a clinical trial exclusion criterion. Annotated with entity spans:
[Person: Women] with [Qualifier: previous] [Procedure: SLNBx] or [Procedure: axillary node dissection]